最少見的肛門管是那一類型？
A. Intersphincteric type
B. Suprasphincteric type
C. Extrasphincteric type
D. Transsphincteric type

正確答案：C. Extrasphincteric type